Clinical trial exclusion criterion:
Thyroxin (stable dose for ≥ 30 days); The last use of any other prescription medication will need follow the criteria for all other cohorts, as outlined above.

Annotated entities:
- Drug: "Thyroxin"
- Qualifier: "stable dose"
- Temporal: "≥ 30 days"
- Context_Error: "The last use of any other prescription medication will need follow the criteria for all other cohorts, as outlined above."
- Non-query-able: "The last use of any other prescription medication will need follow the criteria for all other cohorts, as outlined above."